Rindopepimut is an analog of which growth factor?

Rindopepimut is a peptide vaccine which elicits EGFRvIII-specific humoral and cellular immune responses.